關於卵巢癌的敘述，下列何者最不適當？
A. 最常見的病理型態是卵巢上皮細胞癌（ovarian epithelial carcinoma）
B. 低惡性度卵巢癌（borderline adenocarcinoma）預後比黏液性卵巢癌（mucinous
C. 卵巢癌減積手術包含子宮卵巢輸卵管全切除，淋巴結清除，網膜切除則不需要
D. 理想的卵巢癌減積手術（debulking surgery）是盡量切除原發與轉移的腫瘤

正確答案：C. 卵巢癌減積手術包含子宮卵巢輸卵管全切除，淋巴結清除，網膜切除則不需要